Clinical trial inclusion criterion:
A claimed prescription of a NOAC from a Danish pharmacy within 14 days of discharge or outpatient clinic visit.

Annotated entities:
- Procedure: "prescription"
- Drug: "NOAC"
- Qualifier: "Danish pharmacy"
- Temporal: "within 14 days of discharge or outpatient clinic visit"
- Reference_point: "discharge or outpatient clinic visit"
- Procedure: "discharge"
- Procedure: "outpatient clinic visit"
- Visit: "outpatient clinic"
- Qualifier: "claimed"